Patient not expected to survive more than 4 days

The above is a clinical trial exclusion criterion. Annotated with entity spans:
Patient [Negation: not] expected to [Observation: survive] [Value: more than 4 days]